以下對於膝下截肢術後復健內容的敘述，何者最正確？
A. 應避免大腿肌力訓練，以免肌肉肥大導致義肢裝置困難
B. 膝關節屈曲攣縮 30 度，不會影響義肢裝置
C. 應維持髖關節的活動度，以免影響行走
D. 殘肢應避免包覆，以免皮膚過度敏感，影響義肢裝置

正確答案：C. 應維持髖關節的活動度，以免影響行走